下列有關雷氏症候群（Reye syndrome）之敘述，何者錯誤？
A. 病情大多為劇烈嘔吐後出現意識障礙
B. 病理變化為肝、腦細胞之微細脂肪顆粒沈積
C. 血中轉胺基酶值（GOT、GPT）及氨值會升高
D. 此病之發生與服用水楊酸（salicylate）無關

正確答案：D. 此病之發生與服用水楊酸（salicylate）無關